Patients may be excluded from the study for other reasons, at the investigator's discretion with detailed documentation.

The above is a clinical trial exclusion criterion. Annotated with entity spans:
[Non-query-able: Patients may be excluded from the study for other reasons, at the investigator's discretion with detailed documentatio]n.